No evidence of recent new inflammatory disease activity (inactive by the Lublin criteria16) with no new relapse for at least five years and no new MRI lesion for at least three years

The above is a clinical trial inclusion criterion. Annotated with entity spans:
[Negation: No] evidence of recent [Qualifier: new] [Condition: inflammatory disease] activity ([Value: inactive] by the [Measurement: Lublin criteria]16) with [Negation: no] [Qualifier: new] [Condition: relapse] [Temporal: for at least five years] and [Negation: no] [Qualifier: new] [Procedure: MRI] [Condition: lesion] [Temporal: for at least three years]